下列何者是置放 flow-directed pulmonary artery catheter 記錄肺動脈楔壓（wedge pressure）時，觀察有 prominent v waves 存在的原因？①tricuspid atresia ②aortic valve stenosis ③aortic regurgitation ④mitral regurgitation
A. ①②③
B. ①③
C. ②④
D. ④

正確答案：D. ④